HCV RNA evidence of HCV infection

The above is a clinical trial inclusion criterion. Annotated with entity spans:
[Measurement: HCV RNA] evidence of [Condition: HCV infection]